Clinical trial exclusion criterion:
Sitting systolic BP < 100 mmHg

Entity relations:
- Has_qualifier("systolic BP", "Sitting")
- Has_value("systolic BP", "< 100 mmHg")